A failed therapeutic trial of escitalopram in the current depressive episode (defined as at least 6 weeks of treatment at a daily dose of 10mg or higher)

The above is a clinical trial exclusion criterion. Annotated with entity spans:
A [Qualifier: failed] [Procedure: therapeutic trial] of [Drug: escitalopram] [Temporal: in the current depressive episode] (defined as [Temporal: at least 6 weeks of treatment] at a [Multiplier: daily dose of 10mg or higher])